Current or past (within the last 5 years) malignant neoplasms (except basal cell and squamous cell skin carcinoma)

The above is a clinical trial exclusion criterion. Annotated with entity spans:
[Temporal: Current] or [Temporal: past] ([Temporal: within the last 5 years]) [Condition: malignant neoplasms] ([Negation: except] [Condition: basal cell] and [Condition: squamous cell skin carcinoma])